Clinical trial inclusion criterion:
Patient has attempted physical therapy and corticosteroid injections with local anesthetic -Previous injections of lidocaine and corticosteroid provided at least minor immediate relief

Entity relations:
- AND("corticosteroid injections", "ocal anesthetic")